Antibiotics within 72 h

The above is a clinical trial exclusion criterion. Annotated with entity spans:
[Drug: Antibiotics] [Temporal: within 72 h]